diagnosed with PD by a neurologist (Fahn and Elton, 1987);

The above is a clinical trial inclusion criterion. Annotated with entity spans:
diagnosed with [Condition: PD] [Qualifier: by a neurologist] (Fahn and Elton, 1987);